Clinical trial inclusion criterion:
Able to sign informed consent

Annotated entities:
- Observation: "Able to sign informed consent"